Clinical trial inclusion criteria:
Adult patients (= 18 years)
Patient on hemodialysis treatment for at least 1 month
Patient with a history of, or presenting a new episode of atrial fibrillation (either permanent or paroxysmal).
Patient with a CHADS2VASC score =2
Patient with high risk of bleeding as defined by (1) HASBLED score =3 OR (2) HASBLED = CHADS2VASC score, OR (3) recent history of severe bleeding (type 3a, 3b, 3c), particularly cerebral or gastrointestinal, OR (4) prior recurrent (>2) history of falls.
Patient capable of understanding information about the study and of giving his/her consent
Patient informed of the preliminary medical exam results
Patient with healthcare insurance
Written consent signed

Annotated entities:
- Person: "Adult"
- Person: "years"
- Value: "= 18"
- Procedure: "hemodialysis"
- Temporal: "at least 1 month"
- Condition: "atrial fibrillation"
- Qualifier: "new episode"
- Measurement: "CHADS2VASC score"
- Value: "=2"
- Observation: "risk of bleeding"
- Qualifier: "high"
- Measurement: "HASBLED score"
- Value: "=3"
- Measurement: "CHADS2VASC score"
- Condition: "severe bleeding"
- Qualifier: "type 3a, 3b, 3c"
- Qualifier: "cerebral"
- Qualifier: "gastrointestinal"
- Observation: "falls"
- Multiplier: ">2"
- Qualifier: "recurrent"
- Post-eligibility: "Patient capable of understanding information about the study and of giving his/her consent"
- Post-eligibility: "Patient informed of the preliminary medical exam results"
- Non-query-able: "Patient with healthcare insurance"
- Informed_consent: "Written consent signed"